Clinical trial inclusion criterion:
Age ≥ 18 years

Entity relations:
- Has_value("Age", "≥ 18 years")